La estimulación hormonal de la formación del segundo mensajero inositol 1,4,5-trisfosfato (IP3) conduce rápidamente a la liberación de qué otro mensajero intracelular:
1. AMP cíclico.
2. Prostaglandina.
3. Calcio.
4. Leucotrieno.
5. Tromboxano.

Respuesta correcta: 3. Calcio.